La placenta es un derivado de:
1. La zona pelúcida.
2. El trofoblasto.
3. El ectodermo.
4. El mesodermo.
5. La línea primitiva.

Respuesta correcta: 2. El trofoblasto.